一位年約 30 歲女性因長期無月經至婦產科求診，驗孕結果為陰性，病患並提到時有乳汁分泌的情形，且抽血檢驗血中 prolactin 濃度超過正常值約 1 千倍以上，因此轉至神經外科門診。則醫師安排之下列處置，何者最不適當？
A. 腦部磁振造影（MRI）
B. 視野檢查
C. 頸動脈超音波
D. 抽血檢測 GH, ACTH, TSH 之血中濃度

正確答案：C. 頸動脈超音波